Underlying illness

The above is a clinical trial exclusion criterion. Annotated with entity spans:
[Condition: Underlying illness]